Unexplained infertility.

The above is a clinical trial inclusion criterion. Annotated with entity spans:
[Qualifier: Unexplained] [Condition: infertility].